What memory problems are reported in the " Gulf war syndrome"?

Loss of memory and dysmnesia are memory problems reported in the " Gulf war syndrome". Patients suffering from this syndrome often have other
nonspecific symptoms such as fatigue, skin rash, headache, muscle and joint pain and sexual dysfunction.